Clinical trial exclusion criterion:
2. Cannot tolerate or comply with compression therapy.

Annotated entities:
- Parsing_Error: "2."
- Procedure: "compression therapy"
- Non-query-able: "Cannot tolerate or comply with"
- Post-eligibility: "Cannot tolerate or comply with"